Which micro-RNAs (miR) are associated with the human cycloxygenase-2 (COX-2) gene promoter?

miR-16 was shown to bind the COX-2 3'-UTR and inhibit COX-2 expression by promoting rapid mRNA decay.  miR-143-5p directly targets COX-2. The NF-kB family member RelB regulates microRNA miR-146a to suppress cigarette smoke-induced COX-2 protein expression in lung fibroblasts. TargetScan analysis predicted COX-2 as a target of miR-26a and miR-26b. miR-26a/-26b decreased luciferase activity associated with COX-2-3'-UTR. microRNA-142-3p inhibits apoptosis and inflammation induced by bleomycin through down-regulation of Cox-2 in MLE-12 cells. MicroRNA-144 is regulated by CP2 and decreases COX-2 expression and PGE2 production in mouse ovarian granulosa cells. The down-regulation of microRNA-137 contributes to the up-regulation of retinoblastoma cell proliferation and invasion by regulating COX-2/PGE2 signaling. MicroRNA-128 inhibits proliferation and invasion of glioma cells by targeting COX-2. Altered expression of miR-146b-3p is closely related to the progression and development of DCMI mediating the RAF/P38MAPK/COX-2 signal transduction pathway. MicroRNA-101 inhibits angiogenesis via COX-2 in endometrial carcinoma.